在呼吸道黏膜內，可以中和入侵細菌之最重要抗體為：
A. IgA
B. IgG
C. IgE
D. IgM

正確答案：A. IgA